Clinical trial inclusion criterion:
Forced expiratory volume/Forced vital capacity (FEV1 / FVC) > 70% of predicted;

Entity relations:
- Has_value("Forced expiratory volume/Forced vital capacity (FEV1 / FVC)", "> 70% of predicted")